Clinical trial exclusion criterion:
Patients on current anticoagulant therapy

Entity relations:
- Has_temporal("anticoagulant therapy", "current")